Clinical trial exclusion criterion:
Subjects with acute liver disease or active peptic ulcer disease.

Annotated entities:
- Condition: "acute liver disease"
- Condition: "peptic ulcer disease"
- Temporal: "active"